Clinical trial inclusion criterion:
known anemia (hemoglobin <10 g/dL) at the time of screening

Annotated entities:
- Condition: "anemia"
- Measurement: "hemoglobin"
- Value: "<10 g/dL"
- Temporal: "at the time of screening"
- Reference_point: "the time of screening"